Clinical trial exclusion criterion:
Women who are less than 6 weeks postpartum

Entity relations:
- Has_index("less than 6 weeks postpartum", "postpartum")
- Has_temporal("Women", "less than 6 weeks postpartum")